Clinical trial inclusion criteria:
Subjects aged 12-65.
Confirmed idiopathic pulmonary hypertension, connective tissue disease associated pulmonary hypertension, congenital heart disease(with Eisenmenger syndrome) associated pulmonary hypertension.
Baseline 6-minutes walking distance 150m-550m.
WHO pulmonary hypertension function II-III with non-responder to calcium channel blockers.
Documented written informed consent.

Annotated entities:
- Person: "aged"
- Value: "12-65"
- Condition: "idiopathic pulmonary hypertension"
- Qualifier: "connective tissue disease associated"
- Condition: "pulmonary hypertension"
- Qualifier: "congenital heart disease"
- Condition: "Eisenmenger syndrome"
- Condition: "pulmonary hypertension"
- Measurement: "6-minutes walking distance"
- Value: "150m-550m"
- Temporal: "Baseline"
- Measurement: "WHO pulmonary hypertension function"
- Value: "II-III"
- Condition: "non-responder to calcium channel blockers"
- Drug: "calcium channel blockers"
- Observation: "written informed consent"